台灣的全民健康保險是在那一年開始實施的？
A. 1985
B. 1990
C. 1995
D. 2000

正確答案：C. 1995